Clinical trial inclusion criteria:
Adults (= 18 years of age) with World Health Organization Group 2 Pulmonary Hypertension (Mean pulmonary artery pressure = 25 mmHg and pulmonary capillary wedge pressure = 15 mmHg)
New York Heart Association class II-IV symptoms
Left ventricular ejection fraction (LVEF) = 45%

Annotated entities:
- Person: "Adults"
- Value: "= 18 years"
- Person: "age"
- Condition: "Pulmonary Hypertension"
- Qualifier: "World Health Organization Group 2"
- Measurement: "(Mean pulmonary artery pressure"
- Value: "= 25 mmHg"
- Measurement: "pulmonary capillary wedge pressure"
- Value: "= 15 mmHg"
- Measurement: "New York Heart Association"
- Value: "class II-IV"
- Condition: "symptoms"
- Measurement: "Left ventricular ejection fraction (LVEF)"
- Value: "= 45%"